En una característica del síndrome de PraderWilli:
1. Labio leporino.
2. Retraso mental severo.
3. Risa incontrolada.
4. Obesidad después del año de edad.

Respuesta correcta: 4. Obesidad después del año de edad.